Need for chronic oral anticoagulant therapy

The above is a clinical trial exclusion criterion. Annotated with entity spans:
[Mood: Need for] [Procedure: chronic oral anticoagulant therapy]